Clinical trial exclusion criterion:
History of alcohol or drug abuse in the previous 3 months

Entity relations:
- Has_temporal("alcohol abuse", "in the previous 3 months")
- OR("alcohol abuse", "drug abuse")